Clinical trial exclusion criteria:
Smoker or former smoker.
Presence of dental prostheses.
Presence of orthodontic devices.
Antibiotic treatment or routine use of oral antiseptics in the previous 3 months.
Presence of any systemic disease that could alter the production or composition of saliva.

Annotated entities:
- Condition: "Smoker"
- Condition: "former smoker"
- Device: "dental prostheses"
- Device: "orthodontic devices"
- Drug: "Antibiotic"
- Multiplier: "routine use"
- Drug: "oral antiseptics"
- Temporal: "in the previous 3 months"
- Condition: "systemic disease"
- Qualifier: "could alter the production or composition of saliva"